Clinical trial inclusion criterion:
at modified Hoehn and Yahr (H&Y) stage 1.5 to 3 (Hoehn and Yahr ,1967; Goetz et al., 2004);

Entity relations:
- Has_value("modified Hoehn and Yahr (H&Y)", "stage 1.5 to 3")